residents at low altitude (<800 m)

The above is a clinical trial inclusion criterion. Annotated with entity spans:
[Non-query-able: residents at low altitude (<800 m)]